Patients who have been on a tumor necrosis factor alpha (TNFa) inhibitor (not more than one) must have experienced an inadequate response to previous or current treatment given at an approved dose for at least 3 months prior to baseline or had been intolerant upon administration of an anti-TNFa agent

The above is a clinical trial inclusion criterion. Annotated with entity spans:
Patients who have been on a [Drug: tumor necrosis factor alpha (TNFa) inhibitor] ([Multiplier: not more than one]) must have experienced an [Condition: inadequate response] to [Temporal: previous] or [Temporal: current] [Procedure: treatment] given at an [Multiplier: approved dose] [Temporal: for at least 3 months prior to baseline] or had been [Condition: intolerant] upon administration of an [Drug: anti-TNFa agent]